Requires VTE thromboprophylaxis

The above is a clinical trial inclusion criterion. Annotated with entity spans:
Requires [Condition: VTE] [Procedure: thromboprophylaxis]